Clinical trial exclusion criterion:
Suspected cobra bite, OR

Entity relations:
- Has_mood("cobra bite", "Suspected")